Presence of adnexal mass.

The above is a clinical trial exclusion criterion. Annotated with entity spans:
Presence of [Condition: adnexal mass].